Clinical trial exclusion criterion:
Subject with a bleeding disorder

Annotated entities:
- Condition: "bleeding disorder"